Clinical trial exclusion criterion:
WBC < 3.5/ml

Entity relations:
- Has_value("WBC", "< 3.5/ml")